Drugs with a known impact on the immune system or on platelet function must be recorded and an exclusion of the study should be discussed with the study center

The above is a clinical trial exclusion criterion. Annotated with entity spans:
[Subjective_judgement: Drugs with a known impact on the immune system or on platelet function must be recorded and an exclusion of the study should be discussed with the study center]